Clinical trial exclusion criterion:
Psychiatric desease

Annotated entities:
- Condition: "Psychiatric desease"